Ongoing epilepsy or other seizure disorder, or use of medications for a seizure disorder within 6 months of screening or any time between screening and randomization

The above is a clinical trial exclusion criterion. Annotated with entity spans:
[Temporal: Ongoing] [Condition: epilepsy] or [Qualifier: other] [Condition: seizure disorder], or use of [Drug: medications] for a [Condition: seizure disorder] [Temporal: within 6 months of screening] or [Temporal: any time between screening and randomization]